中腦動脈（middle cerebral artery）梗塞引起的腦中風病人，最常造成下列何種視野障礙？
A. 兩顳側邊偏盲（bitemporal hemianopia）
B. 兩同側邊偏盲（homonymous hemianopia）
C. 視野中心缺損（central scotoma）
D. 單眼盲（one-eye blindness）

正確答案：B. 兩同側邊偏盲（homonymous hemianopia）